Clinical trial inclusion criterion:
Patient is currently enrolled in a Novartis OGD or GMA-sponsored or Incyte-sponsored clinical study (where Incyte can delegate the sponsorship to a preferred CRO, if applicable) that is approved to enroll into this rollover study, is receiving ruxolitinib and has fulfilled all of the requirements of the parent protocol.

Annotated entities:
- Competing_trial: "Patient is currently enrolled in a Novartis OGD or GMA-sponsored or Incyte-sponsored clinical study (where Incyte can delegate the sponsorship to a preferred CRO, if applicable) that is approved to enroll into this rollover study, is receiving ruxolitinib and has fulfilled all of the requirements of the parent protocol."